子宮頸抹片報告敘述有 koilocytosis，表示最可能有何感染？
A. 披衣菌（Chlamydia）
B. 陰道滴蟲（Trichomonas）
C. 人類乳突病毒（HPV）
D. 淋菌（gonococcus）

正確答案：C. 人類乳突病毒（HPV）